Which are the constitutive parts of a Genomic Regulatory Block (GRB)?

GRBs are spanned by highly conserved noncoding elements (HCNEs), their developmental regulatory target genes, and phylogenetically and functionally unrelated "bystander" genes.